Clinical trial exclusion criterion:
non-English speaking

Annotated entities:
- Observation: "English speaking"
- Negation: "non"